Pulse oximetry of 90% or greater on room air

The above is a clinical trial inclusion criterion. Annotated with entity spans:
[Measurement: Pulse oximetry] of [Value: 90% or greater] [Qualifier: on room air]